Clinical trial inclusion criterion:
Written informed consent.

Annotated entities:
- Post-eligibility: "Written informed consent"